進一步進行檢測，以下那些檢測與臆斷方向是不合理的？
A. 急性Ｂ型肝炎是可能診斷之一，建議檢測HBsAg與IgG anti-HBc
B. 臺灣為B型肝炎盛行國家，慢性B型肝炎急性發作相當常見，需列入鑑別診斷，未來PT INR恢復正常之後，  	肝穿刺檢查可幫助判斷
C. 急性C型肝炎為可能診斷之一，建議檢測anti-HCV，若呈現陽性反應，可進一步檢測HCV RNA
D. 患者ALP數值在正常範圍之內，因急性膽道阻塞而引起肝炎的機會並不大

正確答案：A. 急性Ｂ型肝炎是可能診斷之一，建議檢測HBsAg與IgG anti-HBc